Clinical trial inclusion criterion:
Ongoing treatment with antidepressants

Annotated entities:
- Temporal: "Ongoing"
- Procedure: "treatment"
- Drug: "antidepressants"